Clinical trial exclusion criterion:
Previous gastric resection

Annotated entities:
- Temporal: "Previous"
- Procedure: "gastric resection"